Patients who received systemic anti-cancer treatment prior to the first dose of study drug within the following time frames:

The above is a clinical trial exclusion criterion. Annotated with entity spans:
[Parsing_Error: Patients who received systemic anti-cancer treatment prior to the first dose of study drug within the following time frames:]